不孕（infertility）的定義為：
A. 連續 1 年未避孕而無法足月生產者
B. 連續 1 年未避孕而無法受孕者
C. 連續 2 年未避孕而無法足月生產者
D. 連續 2 年未避孕而無法受孕者

正確答案：B. 連續 1 年未避孕而無法受孕者